下列感染性疾病，何者的典型病理變化會出現小血管炎？①第一、二、三期梅毒 ②斑疹傷寒（typhus） ③壞疽性臁瘡（ecthyma gangrenosum）
A. ①②③
B. 僅①②
C. 僅②③
D. 僅①③

正確答案：A. ①②③